Clinical trial exclusion criterion:
Hypersensibility to ingredients of intervention

Entity relations:
- AND("Hypersensibility", "ingredients of intervention")